Clinical trial exclusion criterion:
Previous bladder injection with onabotulinumtoxinA

Annotated entities:
- Qualifier: "bladder injection"
- Drug: "onabotulinumtoxinA"